Histologically confirmed colorectal adenocarcinoma

The above is a clinical trial inclusion criterion. Annotated with entity spans:
[Qualifier: Histologically confirmed] [Condition: colorectal adenocarcinoma]